¿Cuál de los siguientes elementos presenta una forma alotrópica consistente en un anillo de ocho átomos?:
1. Fósforo.
2. Silicio.
3. Azufre.
4. Boro.

Respuesta correcta: 3. Azufre.